Patients having had an ophthalmic surgical procedure within 6 months of the beginning of the study.

The above is a clinical trial exclusion criterion. Annotated with entity spans:
Patients having had an [Procedure: ophthalmic surgical procedure] [Temporal: within 6 months of the beginning of the study].